Posterior spinal fusion

The above is a clinical trial inclusion criterion. Annotated with entity spans:
[Procedure: Posterior spinal fusion]